Subject has abnormal long or short QT interval, signs of Brugada syndrome, known inheriting ion channel disease on the family, arrhythmogenic right ventricular dysplasia.

The above is a clinical trial exclusion criterion. Annotated with entity spans:
Subject has [Qualifier: abnormal] [Value: long] or [Value: short] [Measurement: QT interval], signs of [Condition: Brugada syndrome], known [Observation: inheriting ion channel disease on the family], [Qualifier: arrhythmogenic] [Condition: right ventricular dysplasia].